Patients previously treated with steroid, anti-cancer medicine, or immunosuppression treatment before CA;

The above is a clinical trial exclusion criterion. Annotated with entity spans:
Patients [Temporal: previously] [Procedure: treated] with [Drug: steroid], [Drug: anti-cancer medicine], or [Procedure: immunosuppression treatment] [Temporal: before CA];